初（primary palate）和次（secondary palate）是以何構造為交界？
A. 門齒孔（incisive foramen）
B. 齒骨（alveolar bone）
C. 門牙（incisor）
D. 懸壅垂（uvula）

正確答案：A. 門齒孔（incisive foramen）